El signo más temprano que se manifiesta en el aumento de la Presión Intracraneal (PIC) es:
1. Hipotensión ortostática.
2. Dificultad respiratoria.
3. Hipertensión arterial mantenida.
4. Cambios en el nivel del estado de conciencia.
5. Vómitos frecuentes.

Respuesta correcta: 4. Cambios en el nivel del estado de conciencia.